La concepción de la persona desde una perspectiva holística ha conseguido todo su significado a partir de los trabajos pertenecientes a la Escuela:
1. Del caring.
2. De la promoción de la salud.
3. De los efectos deseados.
4. De la integralidad.
5. Del ser humano unitario.

Respuesta correcta: 5. Del ser humano unitario.